生長激素注射用於促進身高的效果，於下列何種疾病有最多的實證醫學證據支持，且同時符合美國FDA及臺灣健保給付標準？
A. 透納氏症（Turner syndrome）
B. CATCH 22症候群（CATCH 22 syndrome）
C. 性聯遺傳低血磷佝僂症（X-linked hypophosphatemic rickets）
D. 中樞性性早熟（Central precocious puberty）

正確答案：A. 透納氏症（Turner syndrome）